Which virus type causes Molluscum contagiosum?

Molluscum contagiosum virus (MCV) is a human poxvirus that causes tumor-like skin lesions.